Clinical trial inclusion criterion:
Age 3 to 18 years on day of surgery

Annotated entities:
- Person: "Age"
- Value: "3 to 18 years"
- Temporal: "on day of surgery"